Clinical trial exclusion criterion:
previous esophageal treatment by another method ablation: photodynamic therapy, argon plasma coagulation, laser, ....

Annotated entities:
- Temporal: "previous"
- Procedure: "esophageal treatment"
- Qualifier: "another method"
- Procedure: "ablation"
- Procedure: "photodynamic therapy"
- Procedure: "argon plasma coagulation"
- Procedure: "laser"